Clinical trial exclusion criterion:
Contraindications to study drugs

Annotated entities:
- Condition: "Contraindications"
- Drug: "study drugs"